Ketonuria as confirmed on urine point-of-care testing or urinalysis

The above is a clinical trial inclusion criterion. Annotated with entity spans:
[Condition: Ketonuria] as confirmed on [Measurement: urine point-of-care testing] or [Measurement: urinalysis]